下列何者之兩條外眼肌肉不是共軛肌（yoke muscle）？
A. 右眼外直肌（right lateral rectus muscle）和左眼內直肌（left medial rectus muscle）
B. 右眼上直肌（right superior rectus muscle）和左眼上斜肌（left superior oblique muscle）
C. 右眼上直肌（right superior rectus muscle）和左眼下斜肌（left inferior oblique muscle）
D. 右眼內直肌（right medial rectus muscle）和左眼外直肌（left lateral rectus muscle）

正確答案：B. 右眼上直肌（right superior rectus muscle）和左眼上斜肌（left superior oblique muscle）